Subject with cardiac pacemaker or other implanted electromedical device.

The above is a clinical trial exclusion criterion. Annotated with entity spans:
Subject with [Device: cardiac pacemaker] or other [Device: implanted electromedical device].